干擾素-γ（IFN-γ）由何種細胞產生？
A. 血管內皮細胞
B. 上皮細胞
C. 纖維母細胞
D. T 細胞

正確答案：D. T 細胞